Clinical trial exclusion criterion:
Use of tobacco products other than cigarettes in past 30 days

Annotated entities:
- Observation: "Use of tobacco"
- Negation: "other than"
- Observation: "cigarettes"
- Temporal: "past 30 days"